Clinical trial exclusion criterion:
Allergy to porphyrins and analogues; Photosensitivity; Porphyria; Allergic constitution;

Annotated entities:
- Condition: "Allergy"
- Drug: "porphyrins"
- Drug: "porphyrins analogues"
- Condition: "Photosensitivity"
- Condition: "Porphyria"
- Condition: "Allergic constitution"